What is the main focus of the CVE R/Bioconductor package?

interactive variant prioritisation